Clinical trial exclusion criterion:
Systolic Blood Pressure < 80 mmHg / Mean arterial pressure < 50 mmHg on maximal support

Entity relations:
- Has_value("Systolic Blood Pressure", "< 80 mmHg")
- Has_value("Mean arterial pressure", "< 50 mmHg")
- Has_qualifier("Systolic Blood Pressure", "on maximal support")
- multi("on maximal support", "support")
- OR("Systolic Blood Pressure", "Mean arterial pressure")